don't have heart disease

The above is a clinical trial exclusion criterion. Annotated with entity spans:
[Negation: don't have] [Condition: heart disease]